Spontaneous breathing activity of at least 6 breaths/minute

The above is a clinical trial inclusion criterion. Annotated with entity spans:
[Measurement: Spontaneous breathing activity] of [Value: at least 6 breaths/minute]